Clinical trial inclusion criterion:
male patients with androgenetic alopecia between 18 years and 60 years

Entity relations:
- Has_value("years", "between 18 years and 60 years")